What is Desomorphine?

Desomorphine is an opioid misused as "crocodile", a cheaper alternative to heroin